¿Cuál es la droga no legal más consumida en España?:
1. Cocaína.
2. Drogas de síntesis.
3. GHB (éxtasis líquido).
4. Cannabis.

Respuesta correcta: 4. Cannabis.